Which human chromosome is the product of fusion?

Origin of human chromosome 2: an ancestral telomere-telomere fusion. It is known that human chromosome 2 originated from the fusion of two ancestral primate chromosomes.